Clinical trial inclusion criterion:
weight over 40 kg

Annotated entities:
- Measurement: "weight"
- Value: "over 40 kg"